Clinical trial exclusion criterion:
Ischemic stroke (determined using the Questionnaire for Verifying Stroke-Free Status (QVSFS)

Entity relations:
- Has_qualifier("Ischemic stroke", "Questionnaire for Verifying Stroke-Free Status (QVSFS)")